Clinical trial inclusion criterion:
Patients undergoing surgery on shoulder, humerus, or clavicle

Entity relations:
- Has_qualifier("surgery", "shoulder")
- OR("shoulder", "humerus", "clavicle")